Clinical trial exclusion criterion:
persons with terminal illness

Annotated entities:
- Condition: "terminal illness"